Clinical trial exclusion criterion:
children under 3 months of age

Entity relations:
- Has_value("age", "under 3 months")